有關氣性壞疽（gas gangrene）之敘述，下列何者錯誤？
A. 最常見之致病菌為化膿性鏈球菌（Streptococcus pyogenes）
B. 是經由傷口感染之急性肌肉壞死性疾病，感染會急速往周邊擴散而使病灶擴大
C. 治療方法包括清創術（debridement）、抗生素治療及傷口高壓氧治療（hyperbaric oxygen therapy）
D. 目前尚無有效的疫苗（vaccine）

正確答案：A. 最常見之致病菌為化膿性鏈球菌（Streptococcus pyogenes）